any medical condition that would contraindicate use of stimulant medication

The above is a clinical trial exclusion criterion. Annotated with entity spans:
any [Condition: medical condition] that would [Condition: contraindicate] use of [Drug: stimulant medication]